Clinical trial exclusion criterion:
Insulin requiring diabetes

Entity relations:
- AND("diabetes", "Insulin")